Clinical trial exclusion criterion:
Presence of an AIDS-defining opportunistic infection within 6 months prior to entry. Note: Refer to the A5324 Manual of Operations (MOPS) for the list of AIDS-defining opportunistic infections.

Entity relations:
- Has_temporal("AIDS-defining opportunistic infection", "within 6 months prior to entry")